Patients who tool medicine such as PPI, APA,H2blocker, Muscarine receptor antagonist, anti-gastic agent, antacid, anticaogulant, Bisphosphonate agents, Cytotoxic drug, NSAID, adrenal cortex hormone agents (topical treatment is allowed)

The above is a clinical trial exclusion criterion. Annotated with entity spans:
Patients who tool medicine such as [Drug: PPI], [Drug: APA],[Drug: H2blocker], [Drug: Muscarine receptor antagonist], [Drug: anti-gastic agent], [Drug: antacid], [Drug: anticaogulant], [Drug: Bisphosphonate agents], [Drug: Cytotoxic drug], [Drug: NSAID], [Drug: adrenal cortex hormone agents] ([Procedure: topical treatment] is [Negation: allowed])